Clinical trial exclusion criteria:
Exclusion Criteria: coronary artery disease, diabetes mellitus, contraindications to cardiac magnetic resonance imaging (CMR), weight >350 lbs, inability to lie flat for imaging, anemia, contraindications to regadenoson or aminophylline
HEALTHY: known cardiovascular disease, cardiac risk factors or use of cardiac medications
HYPERTENSIVE: known cardiovascular disease or risk factors aside from hypertension or use of cardiac medications
HFpEF: prior history of LVEF below 50%, acute decompensated HF, moderate or greater valvular disease, significant cardiac arrhythmias, pericardial disease, congenital heart disease, primary pulmonary hypertension

Annotated entities:
- Condition: "coronary artery disease"
- Condition: "diabetes mellitus"
- Condition: "contraindications"
- Procedure: "cardiac magnetic resonance imaging (CMR)"
- Measurement: "weight"
- Value: ">350 lbs"
- Observation: "inability to lie flat for imaging"
- Condition: "anemia"
- Condition: "contraindications"
- Drug: "regadenoson"
- Drug: "aminophylline"
- Condition: "HEALTHY"
- Condition: "cardiovascular disease"
- Condition: "cardiac risk factors"
- Drug: "cardiac medications"
- Condition: "HYPERTENSIVE"
- Condition: "cardiovascular disease"
- Condition: "cardiovascular risk factors"
- Condition: "cardiovascular risk factors from hypertension"
- Negation: "aside from"
- Drug: "cardiac medications"
- Condition: "HFpEF"
- Temporal: "prior history of"
- Measurement: "LVEF"
- Value: "below 50%"
- Qualifier: "acute"
- Condition: "decompensated HF"
- Qualifier: "moderate"
- Qualifier: "greater"
- Condition: "valvular disease"
- Qualifier: "significant"
- Condition: "cardiac arrhythmias"
- Condition: "pericardial disease"
- Condition: "congenital heart disease"
- Condition: "primary pulmonary hypertension"